known allergy to administered opioid

The above is a clinical trial exclusion criterion. Annotated with entity spans:
known [Condition: allergy] to administered [Drug: opioid]